Clinical trial exclusion criterion:
renal function impairment (serum creatinine >1.5 mg/dl), Fanconi syndrome

Annotated entities:
- Condition: "renal function impairment"
- Measurement: "serum creatinine"
- Value: ">1.5 mg/dl"
- Condition: "Fanconi syndrome"